¿Cuántos complejos macromoleculares forman la cadena de transporte electrónico?:
1. 6 complejos macromoleculares.
2. 5 complejos macromoleculares.
3. 4 complejos macromoleculares.
4. 3 complejos macromoleculares.
5. 2 complejos macromoleculares.

Respuesta correcta: 3. 4 complejos macromoleculares.